La presencia de cuerpos extraños como pequeños botones, pipas de girasol, etc., en las vías respiratorias en niños pequeños es un accidente relativamente frecuente. Señale los signos que aparecen cuando estos objetos se quedan alojados en vía respiratoria inferior:
1. Episodios de tos, ronquera y disnea.
2. Tos crónica, hipoventilación a la auscultación, signos de infección.
3. Asfixia, disnea, cianosis, fracaso respiratorio.
4. Fiebre, tos y disfonía.
5. Taquipnea, aumento del esfuerzo respiratorio.

Respuesta correcta: 2. Tos crónica, hipoventilación a la auscultación, signos de infección.